La fosforilación oxidativa conlleva:
1. La oxidación de H2O para formar O2.
2. La oxidación de O2 para formar H2O.
3. La reducción de H2O para dar O2.
4. La reducción de O2 para dar H2O.
5. Ninguna de las anteriores.

Respuesta correcta: 4. La reducción de O2 para dar H2O.